9. Body weight > 30 kg

The above is a clinical trial inclusion criterion. Annotated with entity spans:
[Parsing_Error: 9.] [Measurement: Body weight] [Value: > 30 kg]